Clinical trial exclusion criterion:
Prior trombosis or myocardial infarction, congenital coagulation disorder, use of anti-coagulants prior to surgery, prior thoracic surgery, pregnancy, pre-operative fibrinogen concentration <1g/L

Entity relations:
- Has_value("fibrinogen concentration", "<1g/L")
- Has_temporal("fibrinogen concentration", "pre-operative")
- Has_temporal("thoracic surgery", "prior")
- Has_temporal("anti-coagulants", "prior to surgery")
- Has_temporal("trombosis", "Prior")
- OR("trombosis", "myocardial infarction", "thoracic surgery", "pregnancy", "fibrinogen concentration", "anti-coagulants", "congenital coagulation disorder")